La proteína MIC-A, expresada en diversos tipos celulares e inducida por situaciones de estrés celular, es reconocida por:
1. Receptores KIR.
2. El Complejo Mayor de Histocompatibilidad (MHC).
3. El receptor NKG2D.
4. Linfocitos B.
5. Receptores tipo NOD.

Respuesta correcta: 3. El receptor NKG2D.